Clinical trial inclusion criterion:
Age: 18 to75 years old;

Entity relations:
- Has_value("Age", "18 to75 years old")